有關發紺（cyanosis）的敘述，下列何者錯誤？
A. 大的patent ductus arteriosus（PDA）引起的差異性發紺（differential cyanosis），經常是下半身發紺
B. 周邊血管疾病引起的發紺部位，經常是在動脈血管管腔狹窄處的下游處
C. 代表的生理意義為血氧含量降低，或是組織的灌注血流量不足
D. 嚴重心衰竭引起的發紺，常伴有小血管的擴張

正確答案：D. 嚴重心衰竭引起的發紺，常伴有小血管的擴張